Has received a live vaccine within 30 days prior to the first dose of study therapy

The above is a clinical trial exclusion criterion. Annotated with entity spans:
Has received a [Condition: live vaccine] within [Temporal: 30 days prior] to the [Reference_point: first dose of study therapy]